內收肌裂孔（adductor hiatus）為位於下列何者的構造？
A. 內收長肌（adductor longus）
B. 內收短肌（adductor brevis）
C. 內收大肌（adductor magnus）
D. 恥骨肌（pectineus）

正確答案：C. 內收大肌（adductor magnus）